Clinical trial exclusion criterion:
6. Pregnant or lactating

Annotated entities:
- Parsing_Error: "6."
- Condition: "Pregnant"
- Condition: "lactating"